any immunosuppressive treatment, such as systemic corticosteroids

The above is a clinical trial exclusion criterion. Annotated with entity spans:
any [Procedure: immunosuppressive treatment], such as [Drug: systemic corticosteroids]